Clinical trial inclusion criterion:
Primary diagnosis other than GAD

Entity relations:
- Has_negation("GAD", "other than")
- AND("Primary diagnosis", "GAD")